Clinical trial inclusion criteria:
Type 2 Diabetes
Hypertension
Estimated glomerular filtration rate (eGFR) > 30 ml/min
Use of Ace Inh and ARB for control of blood pressure who are willing to be placed on alternate drug(s) in the washout period for blood pressure control

Annotated entities:
- Condition: "Type 2 Diabetes"
- Condition: "Hypertension"
- Measurement: "Estimated glomerular filtration rate (eGFR)"
- Value: "> 30 ml/min"
- Drug: "Ace Inh"
- Drug: "ARB"
- Procedure: "control of blood pressure"
- Informed_consent: "willing to be placed on alternate drug(s) in the washout period for blood pressure control"